Women who cannot cooperate with the examinations.

The above is a clinical trial exclusion criterion. Annotated with entity spans:
[Post-eligibility: Women who cannot cooperate with the examinations].